Clinical trial inclusion criterion:
No cognitive deficits

Annotated entities:
- Negation: "No"
- Condition: "cognitive deficits"